Clinical trial inclusion criterion:
receiving venovenous or venoarterial ECMO

Entity relations:
- OR("venovenous ECMO", "venoarterial ECMO")